Clinical trial exclusion criterion:
Atypical Parkinsonian Syndromes

Annotated entities:
- Qualifier: "Atypical"
- Condition: "Parkinsonian Syndromes"